Clinical trial exclusion criterion:
Anticoagulant therapy during the past 1 week of the procedure

Annotated entities:
- Drug: "Anticoagulant"
- Temporal: "during the past 1 week"
- Procedure: "procedure"
- Reference_point: "procedure"